Clinical trial exclusion criterion:
Are known to have protruding left ventricular thrombus or mechanical aortic and mitral valves

Annotated entities:
- Condition: "left ventricular thrombus"
- Device: "mechanical aortic valves"
- Device: "mechanical mitral valves"